Clinical trial exclusion criterion:
radiation exposure exceeding 20mSv in last 12 months

Annotated entities:
- Condition: "radiation exposure"
- Value: "exceeding 20mSv"
- Temporal: "in last 12 months"